Bloodstream infection with Enterobacter spp., Serratia marcescens, Providencia spp., Morganella morganii or Citrobacter freundii (i.e. likely AmpC-producer), and susceptibility to 3rd generation cephalosporins (i.e. ceftriaxone, cefotaxime or ceftazidime), meropenem and piperacillin-tazobactam from at least one blood culture draw. This will be determined in accordance with laboratory methods and susceptibility breakpoints defined by protocols used in the recruiting site laboratories..

The above is a clinical trial inclusion criterion. Annotated with entity spans:
[Condition: Bloodstream infection] with [Qualifier: Enterobacter spp.], [Qualifier: Serratia marcescens], [Qualifier: Providencia spp.], [Qualifier: Morganella morganii] or [Qualifier: Citrobacter freundii] (i.e. likely AmpC-producer), and susceptibility to [Drug: 3rd generation cephalosporins (]i.e. [Drug: ceftriaxone], [Drug: cefotaxime] or [Drug: ceftazidime]), [Drug: meropenem] and [Drug: piperacillin-tazobactam] from [Multiplier: at least one] [Measurement: blood culture] draw. This will be determined in accordance with laboratory methods and susceptibility breakpoints defined by protocols used in the recruiting site laboratories..